下列關於脊椎病理性骨折（pathologic fracture）的敘述，何者錯誤？
A. 多為轉移性腫瘤（metastatic tumor）造成
B. 常見的腫瘤來源為肺癌、乳癌等
C. 判斷腫瘤對於脊髓壓迫的嚴重程度時，CT比MRI更適合
D. 當病患下肢日漸無力或有大小便失禁等症狀時應考慮手術減壓

正確答案：C. 判斷腫瘤對於脊髓壓迫的嚴重程度時，CT比MRI更適合